Clinical trial exclusion criterion:
Current autoimmune disease;

Annotated entities:
- Condition: "autoimmune disease"
- Temporal: "Current"